BMI < 20

The above is a clinical trial exclusion criterion. Annotated with entity spans:
[Measurement: BMI] [Value: < 20]